Clinical trial inclusion criterion:
Liver Transplant Recipients have no acute rejection episodes within 3 months prior to the enrollment and are clinically stable

Annotated entities:
- Person: "Liver Transplant Recipients"
- Negation: "no"
- Qualifier: "acute"
- Condition: "rejection episodes"
- Temporal: "within 3 months prior to the enrollment"
- Reference_point: "the enrollment"
- Condition: "clinically stable"